Describe the N6-methyladenosine RNA modification in AML

The N6-methyladenosine RNA modification in AML is a nucleotide that is not normally found in the DNA of cancer cells. This nucleotide has been shown to have an effect on the cell's ability to divide.